Postgastrectomy syndrome 中的 early dumping 與下列何者無關？
A. insulin secretion
B. serotonin secretion
C. neurotensin secretion
D. enteroglucagon

正確答案：A. insulin secretion